Clinical trial exclusion criteria:
Severe intercurrent infection
Known HIV positivity
Pregnant or lactating
History of hypersensitivity reactions to murine protein-containing products.

Annotated entities:
- Condition: "infection"
- Temporal: "intercurrent"
- Qualifier: "Severe"
- Condition: "HIV positivity"
- Condition: "Pregnant"
- Condition: "lactating"
- Condition: "hypersensitivity reactions"
- Drug: "murine protein-containing products"
- Drug: "murine"